Clinical trial inclusion criterion:
Females of childbearing potential must agree to use an efficacious hormonal or barrier method of birth control during the study. Abstinence is acceptable.

Annotated entities:
- Person: "Females"
- Observation: "childbearing potential"
- Mood: "agree to use"
- Qualifier: "efficacious"
- Qualifier: "hormonal method"
- Qualifier: "barrier method"
- Procedure: "birth control"
- Temporal: "during the study"
- Observation: "Abstinence"